使用抗精神病藥（antipsychotics）引起錐體外症候群（extrapyramidal syndrome）的症狀，下列何者最有可能造成呼吸困難？
A. 肌張力異常（dystonia）
B. 靜坐不能（akathisia）
C. 帕金森氏症候群（parkinsonism）
D. 運動異常（dyskinesia）

正確答案：A. 肌張力異常（dystonia）